下列有關腦中風後中樞痛（central pain）之敘述，何者最為正確？
A. 中樞痛多發生在大腦中樞神經系統病灶之對側
B. 小的中風病灶不會引發中樞痛
C. 中樞痛在病發後一年內發生的比率非常高
D. 大部分中樞痛病人之溫覺（temperature perception）不受影響

正確答案：A. 中樞痛多發生在大腦中樞神經系統病灶之對側